Clinical trial inclusion criterion:
two or more licensed NRTIs

Annotated entities:
- Multiplier: "two or more"
- Drug: "NRTI"
- Qualifier: "licensed"